Currently taking antidepressants or other psychiatric medications

The above is a clinical trial exclusion criterion. Annotated with entity spans:
Currently taking [Drug: antidepressants] or other [Drug: psychiatric medications]